Clinical trial exclusion criterion:
Pregnant or lactating

Entity relations:
- OR("Pregnant", "lactating")